Cancers other than basal cell skin cancers within the last 5 years

The above is a clinical trial exclusion criterion. Annotated with entity spans:
[Condition: Cancers] [Negation: other than] [Condition: basal cell skin cancers] [Temporal: within the last 5 years]